¿Qué coenzima actúa como un inhibidor del ciclo del ácido cítrico (o ciclo de los ácidos tricarboxílicos):
1. Ácido lipoico.
2. Ácido ascórbico.
3. Biocitina.
4. Coenzima Q.
5. NADH+H+.

Respuesta correcta: 5. NADH+H+.